Birilubin = 3mg/dl

The above is a clinical trial inclusion criterion. Annotated with entity spans:
[Measurement: Birilubin] [Value: = 3mg/dl]